Clinical trial inclusion criteria:
Participant aged 19 or over
Available for the entire duration of the study and willing to participate on the basis of the information provided in the FIU duly read and signed.

Annotated entities:
- Person: "aged"
- Value: "19 or over"
- Informed_consent: "Available for the entire duration of the study and willing to participate on the basis of the information provided in the FIU duly read and signed."